Clinical trial exclusion criterion:
Coexisting malignancy

Entity relations:
- Has_qualifier("malignancy", "Coexisting")